Las subunidades ribosómicas se forman en el:
1. Nucleoplasma.
2. Nucléolo.
3. Lámina nuclear.
4. Poro nuclear.
5. Citoplasma.

Respuesta correcta: 2. Nucléolo.